Clinical trial exclusion criterion:
Previous enrolment in this study or treatment with an investigational drug or device under another study protocol in the past 30 days.

Annotated entities:
- Temporal: "Previous"
- Procedure: "treatment with an investigational drug"
- Drug: "investigational drug"
- Observation: "enrolment in this study"
- Device: "device"